Other protocol defined inclusion criteria could apply.

The above is a clinical trial inclusion criterion. Annotated with entity spans:
[Post-eligibility: Other protocol defined inclusion criteria could apply.]